En una investigación, se ha redactado un cuestionario en el que las respuestas siguen un formato escala de tipo Likert. Esta escala:
1. Permite elegir entre 3, 4, 5 ó 6 puntos.
2. Permite que las respuestas sean flexibles.
3. Permite respuestas “no decididas” intermedias.
4. Permite respuestas “no decididas”.

Respuesta correcta: 3. Permite respuestas “no decididas” intermedias.